In what part of the body is the masseter muscle located?

In human anatomy, the masseter is one of the muscles of mastication and is located in the jaw.